Clinical trial exclusion criterion:
PRA > 50%

Entity relations:
- Has_value("PRA", "> 50%")